Clinical trial exclusion criterion:
History of atypical cholinesterase (CP is metabolized by cholinesterase)

Annotated entities:
- Temporal: "History"
- Drug: "atypical cholinesterase"
- Non-representable: "CP is metabolized by cholinesterase"